Si le propongo a un amigo que resuelva un problema como el de la torre de Hanoi, estaré proponiéndole un problema de:
1. Transformación.
2. Inducción de estructuras.
3. Ordenación.
4. Relaciones sociales.
5. Analogías complejas.

Respuesta correcta: 1. Transformación.